Which cells mature in the human thymus?

NF-kB and tonic interferon signals are involved in the final maturation of thymocytes into naive T cells.